Clinical trial exclusion criterion:
Use of oral estrogen therapy, excluding oral contraceptive pills

Entity relations:
- Has_negation("oral contraceptive pills", "excluding")
- AND("oral estrogen therapy", "oral contraceptive pills")